Al realizar el test de Ames, ¿qué resultado revelaría que el compuesto es un mutágeno?
1. División anormal en células de útero de ratón.
2. Crecimiento anormal en ratón.
3. Proliferación de un cultivo de células de ovario de hámster.
4. Reversión en las características de crecimiento de Salmonella.
5. Ninguna opción es correcta.

Respuesta correcta: 4. Reversión en las características de crecimiento de Salmonella.